Clinical trial inclusion criterion:
Age 18-80 years old;

Entity relations:
- Has_value("Age", "18-80 years old")